某大型臨床試驗研究每日服用低劑量 Aspirin 藥物與日後發生心肌梗塞的關係。隨機分配 10000 人到 Aspirin 組，另外分配 10000 人到安慰劑組（Placebo）。追蹤一段時間後 Aspirin 組有 100 人發生心肌梗塞，安慰劑組有 180 人發生心肌梗塞。下列何者錯誤？
A. Aspirin 組比安慰劑組的相對風險比（Relative risk）大於 1
B. 可採 Chi square test 檢定服用 Aspirin 是否與得心肌梗塞有關
C. 可採 Fisher exact test 檢定服用 Aspirin 是否與得心肌梗塞有關
D. 可採 Two-sample z test 檢定兩組得心肌梗塞的風險是否不一樣

正確答案：A. Aspirin 組比安慰劑組的相對風險比（Relative risk）大於 1